All patients receiving a brachial plexus block for anesthesia and/or analgesia

The above is a clinical trial exclusion criterion. Annotated with entity spans:
All patients receiving a [Procedure: brachial plexus block] for anesthesia and/or analgesia